History of convulsions

The above is a clinical trial exclusion criterion. Annotated with entity spans:
[Temporal: History] of [Condition: convulsions]